一位 56 歲的女性大腸癌病患，在經過手術治療後，順利恢復。術後定期的門診追蹤也顯示一切正常。在術後半年接受門診大腸鏡檢查時，只發現乙狀結腸有一個 1 公分半大小的短莖性息肉，其他皆正常。經順利切除息肉後，病人並未感覺任何不適，於是讓病人回家，並安排 1 星期後返診。病人在作完檢查及息肉切除後的頭 2 天都還不錯，但在第 3 天卻突然發生腹部劇痛，經家人送回醫院急診，理學檢查有輕度發燒（38℃），腹部有壓痛及反彈性壓痛，白血球數也增加至 15,000，腹部 X 光檢查出現明顯的腹膜腔內之 free air。則最有可能的診斷是：
A. diverticulitis of colon
B. peptic ulcer perforation
C. colon perforation at polypectomy site
D. perforated appendicitis

正確答案：C. colon perforation at polypectomy site